從公共衛生之預防觀點，政府推動拒菸活動是屬於那一個階段的工作？
A. 殘障控制
B. 健康促進
C. 健康維護
D. 疾病診治

正確答案：B. 健康促進